Clinical trial exclusion criterion:
Subjects who lost >200 mL during a single apheresis or who lost red blood cells on more than one occasion during apheresis within the previous 60 days.

Annotated entities:
- Measurement: "lost red blood cells"
- Value: ">200 mL"
- Multiplier: "single"
- Procedure: "apheresis"
- Procedure: "apheresis"
- Multiplier: "more than one occasion"
- Temporal: "within the previous 60 days"
- Reference_point: "the previous 60 days"